下列何者對 β1-receptor 的選擇性高，常用於治療急性心衰竭的病人？
A. Dobutamine
B. Terbutaline
C. Epinephrine
D. Dopamine

正確答案：A. Dobutamine